Clinical trial exclusion criterion:
Uncontrolled hypertension

Annotated entities:
- Qualifier: "Uncontrolled"
- Condition: "hypertension"